Clinical trial exclusion criterion:
Severe health conditions such as cancer, failure of heart, lung, liver or kidney

Annotated entities:
- Condition: "Severe health conditions"
- Undefined_semantics: "Severe health conditions"
- Subjective_judgement: "Severe health conditions"
- Condition: "cancer"
- Condition: "failure of heart"
- Condition: "failure of lung"
- Condition: "failure of liver"
- Condition: "failure of kidney"